破傷風毒素（Tetanospasmin）對神經細胞的作用為：
A. 分解阻斷性突觸（synapse）之神經傳導物質
B. 抑制傳導物質乙醯膽鹼（acetylcholine）的釋出
C. 促進傳導物質乙醯膽鹼的合成
D. 抑制阻斷性突觸之神經傳導物質的釋出

正確答案：D. 抑制阻斷性突觸之神經傳導物質的釋出